La familia de F. G. de 80 años, que presenta demencia bastante avanzada, quiere solicitar su incapacitación legal. Se sabe que la incapacitación legal:
1. Supone la negación de la capacidad jurídica de la persona.
2. Tiene como objetivo proteger a la persona de potenciales abusos.
3. Limita la capacidad de obrar y la capacidad jurídica de la persona.
4. Puede ser decretada por el médico responsable del paciente.
5. No puede ser solicitada por los familiares del paciente.

Respuesta correcta: 2. Tiene como objetivo proteger a la persona de potenciales abusos.